Clinical trial exclusion criterion:
angioplasty with stenting

Annotated entities:
- Procedure: "angioplasty with stenting"